Clinical trial inclusion criterion:
Females must not be pregnant and must have a negative serum pregnancy test result at the Screening Visit and Day -1.

Entity relations:
- Has_negation("pregnant", "not")
- Has_index("at the Screening Visit and Day -1", "the Screening Visit and Day -1")
- Has_value("serum pregnancy test", "negative")
- Has_temporal("serum pregnancy test", "at the Screening Visit and Day -1")